Clinical trial exclusion criterion:
Chronic pain history

Annotated entities:
- Condition: "Chronic pain"